當抗體由膜固著（membrane-bound）型式轉變為分泌（secreted）型式時，其原理為：
A. DNA 重組（recombination）
B. RNA 剪接（splicing）
C. 蛋白質裂解（degradation）
D. 新的基因表現（expression of a new gene）

正確答案：B. RNA 剪接（splicing）